What has pimavanserin been approved for by the FDA (2018)?

Pimavanserin was approved for the treatment of hallucinations and delusions associated with Parkinson's disease psychosis.